一位患者主訴下肢無力，且有麻木感。理學檢查及神經影像檢查發現第 6 節至第 8 節胸椎脊髓神經有病灶。關於其深部及表淺反射檢查，下述何者最為可能？
A. 二頭肌（biceps）反射及膝反射（knee jerk）均增強，無 Babinski sign
B. 二頭肌反射正常，ankle 反射增強，有 Babinski sign
C. 二頭肌反射及 ankle 反射均減弱，有 Babinski sign
D. 二頭肌反射增強，而膝反射減弱，無 Babinski sign

正確答案：B. 二頭肌反射正常，ankle 反射增強，有 Babinski sign